Clinical trial exclusion criterion:
Contraindication to neuraxial (coagulopathy, anticoagulant use, local infection, sepsis etc) .Rupture of membranes.

Annotated entities:
- Condition: "Contraindication"
- Procedure: "neuraxial"
- Condition: "coagulopathy"
- Drug: "anticoagulant"
- Condition: "local infection"
- Condition: "sepsis"
- Condition: "Rupture of membranes"